診斷嗜鉻細胞瘤的方法中，下列何者最可靠？
A. urine VMA
B. urine catecholamine
C. plasma catecholamine
D. plasma metanephrine

正確答案：D. plasma metanephrine